Clinical trial inclusion criterion:
willing to modify antiretroviral therapy, in accordance with the randomisation assignment

Entity relations:
- Has_context("antiretroviral therapy", "willing")